Clinical trial exclusion criterion:
any history of malnutrition before enrollment

Entity relations:
- Has_temporal("malnutrition", "before enrollment")